¿Qué funciona mejor para mejorar el cumplimiento de los tratamientos médicos mediante intervención psicológica?
1. Dejar completa libertad al paciente para organizar su tratamiento una vez que le expliquemos en qué consiste la causa de su enfermedad y su tratamiento.
2. Que sepa cómo hacer minuciosamente un análisis funcional de su conducta y pase a hacerlo con todas sus conductas problema, especialmente aquellas relacionadas con su conducta de dolor y malestar.
3. Negociar los cambios procurando, siempre que la terapéutica lo permita, que el paciente realice la menor cantidad de conductas en las mínimas ocasiones posibles y fijando secuencialmente las metas o tareas.
4. Entrenarlo en los procesos de negación, negociación, afrontamiento, recuerdo y desesperanza.
5. Controlar los eventos vitales estresantes que se relacionan con su vida, sobre todo a nivel familiar, y con su enfermedad.

Respuesta correcta: 3. Negociar los cambios procurando, siempre que la terapéutica lo permita, que el paciente realice la menor cantidad de conductas en las mínimas ocasiones posibles y fijando secuencialmente las metas o tareas.